ras 基因致癌的機轉主要是：
A. 移位轉接（translocation）
B. 點突變（point mutation）
C. 增幅（amplification）
D. 過多表現（overexpression）

正確答案：B. 點突變（point mutation）